Clinical trial inclusion criteria:
Patients with a histologically, radiologically or haematologically confirmed malignancy whose pain is judged by the investigator to be caused by the malignancy
Patients must have been on a stable daily dose of weak opioids or strong opioids for at least 72 hours prior to the start the study and must remain at the same dosage for the duration of the study
Patients must have a VAS (Visual analog scale) >=40mm

Annotated entities:
- Procedure: "histologically"
- Procedure: "radiologically"
- Procedure: "haematologically"
- Value: "confirmed"
- Condition: "malignancy"
- Condition: "pain"
- Drug: "weak opioids"
- Drug: "strong opioids"
- Temporal: "at least 72 hours prior to the start the study"
- Measurement: "VAS (Visual analog scale)"
- Value: ">=40mm"